引子（primer）是 DNA 複製時的必須材料，下列何者為引子的主要功能？
A. 誘發 DNA 生合成的起點及方向，並決定生合成的終點
B. 可幫助 DNA 雙螺旋的解旋工作，誘發 DNA 的生合成
C. 確定 DNA 生合成的起點及方向，提供一個羥基（-OH）作為 DNA 延伸之用
D. 可決定前導股（leading strand），但無法決定遲緩股（lagging strand）的形成

正確答案：C. 確定 DNA 生合成的起點及方向，提供一個羥基（-OH）作為 DNA 延伸之用